Patients with history of chronic liver disease, cancer or connective tissue disorders.

The above is a clinical trial exclusion criterion. Annotated with entity spans:
Patients with [Temporal: history] of [Condition: chronic liver disease], [Condition: cancer] or [Condition: connective tissue disorders].